一位 50 歲家庭主婦由其女兒與女婿陪同就診，主訴陣發性頭痛有十年之久，一年來常抱怨心悸、失眠、頭暈及全身軟弱，四處就醫不見好轉。最近一個星期其丈夫酒醉駕車出車禍住院，而頭痛症狀愈加明顯。針對頭痛問題的處理，下列那一項資料最有幫助？
A. 頭部 X 光攝影
B. 眼壓測量
C. 腦波圖
D. 家系圖

正確答案：D. 家系圖